La aparición de dificultades e infecciones respiratorias como consecuencia de la disminución de las defensas, es una disfuncionalidad que se produce con mayor probabilidad en:
1. Trastornos maniacos.
2. Trastornos depresivos.
3. Trastornos psicóticos.
4. Trastornos de personalidad.
5. Esquizofrenia.

Respuesta correcta: 2. Trastornos depresivos.